Clinical trial exclusion criterion:
Emergent condition like hematemesis.

Annotated entities:
- Condition: "hematemesis"
- Condition: "Emergent condition"